Clinical trial exclusion criterion:
Known peripheral artery disease

Annotated entities:
- Condition: "peripheral artery disease"